Patients with glaucoma.

The above is a clinical trial exclusion criterion. Annotated with entity spans:
Patients with [Condition: glaucoma].